Patients who were pregnant

The above is a clinical trial exclusion criterion. Annotated with entity spans:
Patients who were [Condition: pregnant]